Clinical trial inclusion criterion:
No contraindication to use of progesterone or combined oral contraceptive pills

Entity relations:
- Has_negation("contraindication", "No")
- AND("contraindication", "progesterone")
- OR("progesterone", "combined oral contraceptive pills")